Clinical trial exclusion criterion:
substance abuse/dependence (including alcohol)

Annotated entities:
- Condition: "substance abuse"
- Condition: "substance dependence"
- Drug: "alcohol"